Clinical trial exclusion criterion:
Evidence of an active or suspected cancer or a history of malignancy where the risk of recurrence is >=20% within 2 years. Patients with a lesion suspicious of hepatic malignancy on a screening imaging study will only be eligible if the likelihood of carcinoma is <=10% following an appropriate evaluation.

Entity relations:
- Has_temporal("cancer", "active")
- Has_value("risk of recurrence", ">=20% within 2 years")
- AND("malignancy", "risk of recurrence")
- Has_mood("hepatic malignancy", "suspicious")
- AND("lesion", "hepatic malignancy")
- Has_value("likelihood of carcinoma", "<=10%")
- AND("lesion", "screening imaging study")
- AND("lesion", "likelihood of carcinoma")
- OR("active", "suspected")
- OR("cancer", "malignancy")